Clinical trial exclusion criterion:
Planned administration/ administration of a vaccine not foreseen by the study protocol during the period starting one month before each dose of vaccine(s) and ending 7 days after dose 1 and dose 2 or 1 month after dose 3.

Annotated entities:
- Mood: "Planned"
- Drug: "vaccine"
- Qualifier: "not foreseen by the study protocol"
- Temporal: "period starting one month before each dose of vaccine(s)"
- Temporal: "1 month after dose 3"
- Temporal: "ending 7 days after dose 1 and dose 2"
- Drug: "dose 1"
- Drug: "dose 2"
- Drug: "dose 3"
- Reference_point: "each dose of vaccine(s)"
- Reference_point: "dose 1 and dose 2"
- Reference_point: "dose 3"